下列何者為粒線體電子傳遞鏈 Complex II 的 electron donor？
A. NADH
B. Succinate
C. NADPH
D. Ubiquinone

正確答案：B. Succinate